Clinical trial exclusion criterion:
Leukemia, lymphomas of any type, melanoma, or other malignant neoplasms affecting the bone marrow or lymphatic systems.

Annotated entities:
- Condition: "Leukemia"
- Condition: "lymphomas"
- Condition: "melanoma"
- Condition: "malignant neoplasms"
- Qualifier: "affecting the bone marrow"
- Condition: "bone marrow"
- Condition: "lymphatic systems"
- Qualifier: "affecting lymphatic systems"